Patient is receiving or scheduled to receive chemotherapy within 30 days before or after the procedure

The above is a clinical trial inclusion criterion. Annotated with entity spans:
Patient [Mood: is receiving] or [Mood: scheduled to receive] [Procedure: chemotherapy] [Temporal: within 30 days before or after the procedure]